patients in dual antiplatelet therapy;

The above is a clinical trial exclusion criterion. Annotated with entity spans:
patients in [Procedure: dual antiplatelet therapy];